Clinical trial exclusion criterion:
Enrollment in a clinical study evaluating another device or drug, within the past 6 months

Annotated entities:
- Competing_trial: "Enrollment in a clinical study evaluating another device or drug, within the past 6 months"